Clinical trial exclusion criterion:
Unable to participate for administrative reasons

Annotated entities:
- Observation: "Unable to participate"
- Qualifier: "administrative reasons"